Clinical trial inclusion criterion:
age >18 years

Entity relations:
- Has_value("age", ">18 years")